Significant anemia or polycythemia defined as hemoglobin >18gm/dL or hemoglobin <7gm/dL

The above is a clinical trial exclusion criterion. Annotated with entity spans:
[Qualifier: Significant] [Condition: anemia] or [Condition: polycythemia] defined as [Measurement: hemoglobin] [Value: >18gm/dL] or [Measurement: hemoglobin] [Value: <7gm/dL]